Chronic migraine: by ICHD-III (International Classification of Headache Disorder) criteria

The above is a clinical trial inclusion criterion. Annotated with entity spans:
[Condition: Chronic migraine]: by [Qualifier: ICHD-III] ([Qualifier: International Classification of Headache Disorder]) criteria